臨床檢查發現病人肋間動脈（intercostal arteries）變大，甚至可摸到脈搏跳動，且 X 光片顯示肋骨下緣有動脈增大的切跡，這些現象顯示病人最可能患有：
A. 先天性橫膈缺損
B. 主動脈狹窄（coarctation of aorta）
C. 開放性卵圓孔（oval foramen）
D. 臍動脈（umbilical artery）閉鎖不全

正確答案：B. 主動脈狹窄（coarctation of aorta）